Clinical trial inclusion criterion:
Patients with psychiatric or addictive disorder that would preclude obtaining informed consent

Entity relations:
- OR("psychiatric disorder", "addictive disorder")